下列有關 Guillain-Barré syndrome 的敘述，何者錯誤？
A. 常可引起四肢無力
B. 疾病嚴重時須考慮使用氣管內插管及呼吸器
C. CSF 中可發現數目很多的單核白血球
D. 可考慮用 plasma exchange 治療

正確答案：C. CSF 中可發現數目很多的單核白血球